Según el DSM (IV-TR y 5) ¿Cuál de los siguientes es requisito para diagnosticar Trastorno de la Tourette?:
1. Un inicio de los síntomas anterior a los 12 años.
2. Que los tics motores y los tics vocales hayan estado presentes en algún momento de la enfermedad de forma concurrente.
3. Que los tics persistan durante más de un año desde la aparición del primer tic.
4. Que hayan estado presentes al menos 3 tics vocales.

Respuesta correcta: 3. Que los tics persistan durante más de un año desde la aparición del primer tic.